Burns

The above is a clinical trial inclusion criterion. Annotated with entity spans:
[Condition: Burns]